高血壓性腦內出血，最好發的位置在：
A. 豆狀核（putamen）
B. 小腦（cerebellum）
C. 橋腦（pons）
D. 視丘（thalamus）

正確答案：A. 豆狀核（putamen）